Age from 40 to 80 years old, either gender;

The above is a clinical trial inclusion criterion. Annotated with entity spans:
[Person: Age] [Value: from 40 to 80 years old], either gender;